下列關於 Zollinger-Ellison Syndrome 的敘述，何者正確？
A. 約四分之一為 MEN 2
B. Total gastrectomy 仍為治療之主要選項
C. 很少 Malignant
D. Secretin test 相當 sensitive 及 specific

正確答案：D. Secretin test 相當 sensitive 及 specific